肌腱（tendon）主要是由下列何者構成？
A. 神經纖維（nerve fiber）
B. 膠原纖維（collagen fiber）
C. 網狀纖維（reticular fiber）
D. 彈性纖維（elastic fiber）

正確答案：B. 膠原纖維（collagen fiber）